Clinical trial inclusion criterion:
8. Reached an average daily pain rating during the baseline week of pain ratings greater than 4 on the 0-to-10 numerical pain rating scale (Question 5 of the BPI)

Annotated entities:
- Measurement: "daily pain rating"
- Temporal: "during the baseline week"
- Reference_point: "baseline week"
- Qualifier: "average"
- Value: "greater than 4"
- Procedure: "0-to-10 numerical pain rating scale"